Clinical trial inclusion criteria:
Woman who had 2 miscarriage before 12(th) week of gestation.The patient who is diagnosed as thrombophilia with recurrent pregnancy loss. Signed consent form.

Annotated entities:
- Person: "Woman"
- Multiplier: "2"
- Condition: "miscarriage"
- Qualifier: "before 12(th) week of gestation"
- Temporal: "before 12(th) week of gestation"
- Reference_point: "12(th) week of gestation"
- Condition: "thrombophilia"
- Multiplier: "recurrent"
- Condition: "pregnancy loss"
- Informed_consent: "Signed consent form."